12. Radiation therapy within 4 weeks prior to, or concurrent with study

The above is a clinical trial exclusion criterion. Annotated with entity spans:
12. [Procedure: Radiation therapy] [Temporal: within 4 weeks prior to], or [Temporal: concurrent with study]